Clinical trial exclusion criterion:
Symptoms suggestive of obstructive or central sleep apnea (with a score of > 10 on Epworth sleepiness scale)

Annotated entities:
- Condition: "obstructive sleep apnea"
- Condition: "central sleep apnea"
- Measurement: "Epworth sleepiness scale"
- Value: "score of > 10"